Inability to complete an MRI (contraindications for MRI include but are not restricted to weight =140 kg, pacemaker, cochlear implants, presence of foreign substances in the eye, intracranial vascular clips, surgery within 6 weeks of entry into the study, coronary stent implanted within 8 weeks prior to the time of the intended MRI, etc…)

The above is a clinical trial exclusion criterion. Annotated with entity spans:
[Mood: Inability to complete] an [Procedure: MRI] ([Condition: contraindications] for [Procedure: MRI] include but are not restricted to [Measurement: weight] [Value: =140 kg], [Device: pacemaker], [Device: cochlear implants], presence of [Device: foreign substances in the eye], [Device: intracranial vascular clips], [Procedure: surgery] [Temporal: within 6 weeks of entry into the study], [Device: coronary stent] [Procedure: implanted] [Temporal: within 8 weeks prior to the time of the intended MRI], etc…)